scheduled for urologic or orthopedic procedure necessitating intrathecal morphine

The above is a clinical trial inclusion criterion. Annotated with entity spans:
scheduled for [Procedure: urologic] or [Procedure: orthopedic procedure] necessitating [Qualifier: intrathecal] [Drug: morphine]